What is the reason for the abundance of operons in the genome of C. elegans?

Previous work has proposed that germline expression drives operon organization in Caenorhabditis elegans . A recent hypothesis proposes that operons provide an evolutionary advantage via the conservation of transcriptional machinery during recovery from growth arrested states . Our data suggest operons and "spliced leader" trans-splicing predate the radiation of the nematode phylum .